Es monosináptico el reflejo:
1. Extensor cruzado.
2. Tendinoso de Golgi.
3. Miotático.
4. De flexión.

Respuesta correcta: 3. Miotático.